Clinical trial exclusion criterion:
5. Active and uncontrolled malignancy

Annotated entities:
- Parsing_Error: "5."
- Condition: "malignancy"
- Qualifier: "uncontrolled"
- Temporal: "Active"